關於亨丁頓舞蹈症（Huntington disease）之敘述，下列何者錯誤？
A. 可能在動作症狀出現前15年，便能看到尾核（caudate nucleus）萎縮
B. 隨	病程的進行，舞蹈症（chorea）的嚴重程度會逐漸加重
C. 認知功能的退化，主要在執行功能（executive function）
D. 年輕發病的病人可能以巴金森症候群（parkinsonism）表現

正確答案：B. 隨	病程的進行，舞蹈症（chorea）的嚴重程度會逐漸加重